active bleeding, clinical findings, that in the judgement of the investigator are associated with an increased risk of bleeding

The above is a clinical trial inclusion criterion. Annotated with entity spans:
[Temporal: active] [Condition: bleeding], [Condition: clinical findings, that in the judgement of the investigator are associated with an increased risk of bleeding]